Taking an NNRTI or integrase containing regimen without prior history of use of PI for more than 2 weeks

The above is a clinical trial inclusion criterion. Annotated with entity spans:
Taking an [Drug: NNRTI] or [Drug: integrase] containing [Procedure: regimen] [Negation: without] [Temporal: prior] history of use of [Drug: PI] [Value: for more than 2 weeks]